Absence of cervical restorations extending to the CEJ

The above is a clinical trial inclusion criterion. Annotated with entity spans:
[Negation: Absence] of [Observation: cervical restorations extending to the CEJ]